Clinical trial exclusion criterion:
Known or suspected pregnant women

Entity relations:
- Has_mood("pregnant", "Known")
- OR("Known", "suspected")